下列何者不屬於屈戌關節（hinge joint）？
A. 掌指關節（Metacarpophalangeal joint）
B. 踝關節（Ankle joint）
C. 肘關節（Elbow joint）
D. 指間關節（Interphalangeal joint）

正確答案：A. 掌指關節（Metacarpophalangeal joint）